Subjects were not to have a history of alcohol or drug abuse within 2 years prior to the study (subjects with a history of previous use of cannabis were not excluded unless they had used cannabis or cannabinoid based medicine within 30 days prior to study drug administration or were unwilling to abstain for the duration of the study).

The above is a clinical trial exclusion criterion. Annotated with entity spans:
Subjects were [Negation: not] to have a [Temporal: history] of [Condition: alcohol] or [Condition: drug abuse] [Temporal: within 2 years prior to the study] [Not_a_criteria: (subjects with a history of previous use of cannabis were not excluded unless they had used cannabis or cannabinoid based medicine within 30 days prior to study drug administration or were unwilling to abstain for the duration of the study)].